脊髓神經肌肉萎縮症（spinal muscular atrophy）會造成病患廣泛肌肉萎縮，但何種肌肉群組不受影響？
A. 外眼球運動肌肉
B. 呼吸運動肌肉
C. 面部表情肌肉
D. 吸吮吞嚥肌肉

正確答案：A. 外眼球運動肌肉